Clinical trial inclusion criterion:
10 = Beck Depression Inventory (BDI) <30 points

Annotated entities:
- Measurement: "Beck Depression Inventory (BDI)"
- Value: "<30 points"